Clinical trial exclusion criterion:
Suffering major events or having mood swings.

Entity relations:
- OR("major events", "mood swings")